Systemic or inhaled corticosteroids.

The above is a clinical trial exclusion criterion. Annotated with entity spans:
[Drug: Systemic] or [Drug: inhaled corticosteroids].